Clinical trial exclusion criterion:
psychic disorder (not including mild depression)

Entity relations:
- Has_negation("mild depression", "not")